Clinical trial exclusion criterion:
Patients with documented gastrointestinal, cerebral, or other hemorrhage within 3 months of the operation;

Annotated entities:
- Condition: "gastrointestinal hemorrhage"
- Condition: "cerebral hemorrhage"
- Condition: "hemorrhage"
- Temporal: "within 3 months of the operation"
- Reference_point: "operation"